Clinical trial exclusion criterion:
History of intolerance (including Grade 3-4 infusion reaction) or hypersensitivity to trastuzumab, murine proteins, or docetaxel.

Annotated entities:
- Condition: "intolerance"
- Condition: "infusion reaction"
- Measurement: "Grade"
- Value: "3-4"
- Condition: "hypersensitivity"
- Drug: "trastuzumab"
- Drug: "murine proteins"
- Drug: "docetaxel"
- Temporal: "History of"